La atmósfera delirante se refiere a:
1. La interpretación delirante de una percepción normal.
2. La experiencia subjetiva de que el mundo ha cambiado de un modo sutil pero siniestro y difícil de definir.
3. La preocupación que generan los delirios.
4. La multimodalidad de la sintomatología delirante.

Respuesta correcta: 2. La experiencia subjetiva de que el mundo ha cambiado de un modo sutil pero siniestro y difícil de definir.